Clinical trial exclusion criterion:
23. Hemoglobin concentration <9 g/dL at Screening.

Annotated entities:
- Parsing_Error: "23."
- Measurement: "Hemoglobin concentration"
- Value: "<9 g/dL"
- Temporal: "at Screening"
- Reference_point: "Screening"